Clinical trial exclusion criterion:
History or other evidence of chronic pulmonary disease associated with functional limitation. Severe cardiac disease (e.g., NYHA Functional Class III or IV, myocardial infarction within 6 months, ventricular tachyarrhythmias requiring ongoing treatment, unstable angina or other significant cardiovascular diseases).

Entity relations:
- AND("chronic pulmonary disease", "functional limitation")
- Has_qualifier("cardiac disease", "Severe")
- Has_temporal("myocardial infarction", "within 6 months")
- Has_temporal("treatment", "ongoing")
- AND("ventricular tachyarrhythmias", "treatment")
- Has_qualifier("cardiovascular diseases", "significant")
- Has_qualifier("cardiovascular diseases", "other")
- Has_value("NYHA", "Functional Class III or IV")
- Subsumes("cardiac disease", "NYHA")
- OR("NYHA", "cardiovascular diseases", "ventricular tachyarrhythmias", "myocardial infarction", "unstable angina")